Known to be severely alpha-1-antitrypsin deficient (PI SZ or ZZ)

The above is a clinical trial exclusion criterion. Annotated with entity spans:
Known to be [Qualifier: severely] [Condition: alpha-1-antitrypsin deficient] (PI SZ or ZZ)